Clinical trial exclusion criterion:
History of overdose or suicidal ideation

Entity relations:
- OR("overdose", "suicidal ideation")